Clinical trial exclusion criterion:
Pregnant or childbearing potential women or breastfeeding women

Annotated entities:
- Condition: "Pregnant"
- Condition: "childbearing potential"
- Person: "women"
- Observation: "breastfeeding"
- Person: "women"